Clinical trial exclusion criterion:
History of allergic disease or reactions likely to be exacerbated by any component of the vaccines.

Annotated entities:
- Condition: "allergic disease"
- Temporal: "History"
- Condition: "reactions allergic"
- Qualifier: "exacerbated"